Clinical trial inclusion criterion:
Female participants of childbearing potential must have a negative urine or serum pregnancy test within 72 hours prior to receiving the first dose of study therapy

Annotated entities:
- Person: "Female"
- Condition: "childbearing potential"
- Measurement: "pregnancy test urine"
- Measurement: "serum pregnancy test"
- Temporal: "within 72 hours prior"
- Value: "negative"
- Reference_point: "receiving the first dose of study therapy"
- Post-eligibility: "Female participants of childbearing potential must have a negative urine or serum pregnancy test within 72 hours prior to receiving the first dose of study therapy"